Clinical trial exclusion criterion:
Nonfluency or inability to communicate in English spoken language

Annotated entities:
- Non-query-able: "Nonfluency or inability to communicate in English spoken language"